Clinical trial inclusion criterion:
Creatinine clearance = 60 ml/min (via Cockcroft-Gault formula)

Annotated entities:
- Measurement: "Creatinine clearance"
- Value: "= 60 ml/min"
- Measurement: "Cockcroft-Gault formula"